Clinical trial inclusion criteria:
Advanced solid tumor malignancy (during expansion at the maximum tolerated dose, entry will be limited to patients wtih adenocarcinoma of the colon or rectum)
Eastern Cooperative Oncology Group (ECOG) 0 or 1

Annotated entities:
- Condition: "Advanced solid tumor malignancy"
- Parsing_Error: "during expansion at the maximum tolerated dose, entry will be limited to patients wtih adenocarcinoma of the colon or rectum"
- Measurement: "Eastern Cooperative Oncology Group (ECOG)"
- Value: "0 or 1"